Which domain of the MOZ/MYST3 protein complex associates with histone H3?

ere we report novel insights into histone H3 tail structure in complex with the double PHD finger (DPF) of the lysine acetyltransferase MOZ/MYST3/KAT6A.